Clinical trial exclusion criterion:
Known allergy to Granisetron or local anaesthetic (heavy bupivacaine, Marcaine Spinal 0.5% Heavy, 5mg/ml, AstraZeneca ampule)

Annotated entities:
- Condition: "allergy"
- Drug: "Granisetron"
- Drug: "local anaesthetic"
- Drug: "heavy bupivacaine"
- Drug: "Marcaine Spinal 0.5% Heavy"
- Qualifier: "5mg/ml"
- Qualifier: "AstraZeneca ampule"